¿Cómo se define el sangrado uterino irregular o continuo y de intensidad variable que no tiene relación con el ciclo menstrual?:
1. Amenorrea.
2. Menorragia.
3. Dismenorrea.
4. Metrorragia.

Respuesta correcta: 4. Metrorragia.